contraindication against ibuprofen (known or suspected allergy against ibuprofen, anaphylactic reaction against Nonsteroidal anti-inflammatory drugs (NSAID), active or recurrent stomach or duodenal ulcera or bleeding, severe liver or renal insufficiency, inflammatory bowel syndrome, and pregnancy/breastfeeding)

The above is a clinical trial exclusion criterion. Annotated with entity spans:
[Condition: contraindication] against [Drug: ibuprofen] ([Qualifier: known] or [Qualifier: suspected] [Condition: allergy] against [Drug: ibuprofen], [Condition: anaphylactic reaction] against [Drug: Nonsteroidal anti-inflammatory drugs (NSAID)], [Temporal: active] or [Qualifier: recurrent] [Qualifier: stomach] or [Qualifier: duodenal] [Condition: ulcera] or [Condition: bleeding], [Condition: severe liver] or renal insufficiency, [Condition: inflammatory bowel syndrome], and [Condition: pregnancy]/[Observation: breastfeeding])